吳太太於例行性胃內視鏡健康檢查時發現有1公分大小的胃息肉，下列何者需進行息肉切除？
A. 切片病理報告為增生性息肉（hyperplastic polyp）
B. 切片病理報告為腺瘤（adenomatous polyp）
C. 切片病理報告為缺陷瘤（hamartoma）
D. 切片病理報告為異位瘤（heterotopic polyp）

正確答案：B. 切片病理報告為腺瘤（adenomatous polyp）